Clinical trial inclusion criterion:
Patients undergoing urologic surgery.

Annotated entities:
- Procedure: "urologic surgery"